Clinical trial exclusion criterion:
The patients receiving vitamin supplements or who had clinical evidence for an acute illness, renal dysfunction, thyroid dysfunction, chronic inflammatory diseases, inborn errors of homocysteine, cobalamin or folate metabolism, or any other condition known to interfere with homocysteine metabolism will be excluded

Annotated entities:
- Drug: "vitamin supplements"
- Condition: "clinical evidence for an acute illness"
- Condition: "acute illness"
- Undefined_semantics: "clinical evidence for an acute illness"
- Condition: "renal dysfunction"
- Condition: "thyroid dysfunction"
- Condition: "chronic inflammatory diseases"
- Condition: "inborn errors of homocysteine metabolism"
- Condition: "inborn errors of folate metabolism"
- Condition: "inborn errors of cobalamin metabolism"
- Condition: "condition known to interfere with homocysteine metabolism"
- Undefined_semantics: "condition known to interfere with homocysteine metabolism"